下列有關肝腺瘤（Adenoma）的敘述，何者錯誤？
A. 常發生於年輕女性
B. 與長期口服避孕藥可能有關
C. 不易破裂出血
D. 腫瘤指數α-fetoprotein 通常正常

正確答案：C. 不易破裂出血